Clinical trial exclusion criterion:
Prior treatment with Acthar in the past 2mos

Annotated entities:
- Temporal: "Prior"
- Procedure: "treatment"
- Drug: "Acthar"
- Temporal: "in the past 2mos"